Clinical trial inclusion criteria:
Moderate to severe COPD (post-bronchodilator forced expiratory volume in 1 s (FEV1) 30-79%predicted);
Resting functional residual capacity (FRC) >120% predicted;
Clinically stable and on stable triple therapy with an ICS/LABA and tiotropium;
Symptomatic: Baseline Dyspnea Index =8 and answer "in the morning" when asked about what time of day their COPD symptoms are worst.

Annotated entities:
- Qualifier: "Moderate to severe"
- Condition: "COPD"
- Qualifier: "post-bronchodilator"
- Measurement: "forced expiratory volume in 1 s (FEV1)"
- Value: "30-79%predicted"
- Measurement: "Resting functional residual capacity (FRC)"
- Value: ">120% predicted"
- Procedure: "stable triple therapy"
- Condition: "Clinically stable"
- Drug: "ICS/LABA"
- Drug: "tiotropium"
- Measurement: "Baseline Dyspnea Index"
- Value: "=8"
- Observation: "what time of day their COPD symptoms are worst"
- Value: "in the morning"